下列何者不是早產的原因？
A. 前置胎盤（placenta previa）或胎盤早期剝離（abruption）
B. 羊水感染
C. 子宮畸形
D. 無腦兒（anencephaly）

正確答案：D. 無腦兒（anencephaly）